Clinical trial inclusion criterion:
Provides a signed copy of the consent form

Annotated entities:
- Non-query-able: "Provides a signed copy of the consent form"